History of sensitivity to heparin or heparin-induced thrombocytopenia.

The above is a clinical trial exclusion criterion. Annotated with entity spans:
History of [Condition: sensitivity to heparin] or [Condition: heparin-induced thrombocytopenia].